Clinical trial exclusion criterion:
Contraindication of CT Known allergy to iodinated contrast media or history of contrast-induced nephropathy Decreased renal function: elevated serum creatinine(>1.5mg/dl) Contraindication to beta-blockers Severe arrhythmia: arterial fibrillation or uncontrolled tachyarrhythmia, or advanced atrioventricular block (second or third degree heart block)

Entity relations:
- AND("Known allergy", "iodinated contrast media")
- Has_value("renal function", "Decreased")
- Subsumes("elevated", ">1.5mg/dl")
- Has_value("serum creatinine", "elevated")
- AND("Contraindication", "beta-blockers")
- Has_qualifier("arrhythmia", "Severe")
- Subsumes("advanced atrioventricular block", "second degree heart block")
- Subsumes("Contraindication to beta-blockers", "Severe arrhythmia: arterial fibrillation or uncontrolled tachyarrhythmia, or advanced atrioventricular block (second or third degree heart block)")
- Subsumes("Contraindication of CT", "Known allergy to iodinated contrast media or history of contrast-induced nephropathy")
- OR("Known allergy", "contrast-induced nephropathy")
- OR("arterial fibrillation", "uncontrolled tachyarrhythmia", "advanced atrioventricular block")
- OR("second degree heart block", "third degree heart block")